¿Cuál de las siguientes no suele ser una reacción adversa al tratamiento crónico con Corticoides?:
1. Hiperglucemia.
2. Osteoporosis.
3. Hipotensión arterial.
4. Hipercolesterolemia e Hiperlipidemia.

Respuesta correcta: 3. Hipotensión arterial.